Clinical trial inclusion criterion:
Body weight greater than 33.4 kg and a healthy weight using age-based body mass index (BMI) range 5th-85th percentile at screening and baseline. Appendix 3 contains BMI-for-age charts that can be consulted.

Annotated entities:
- Measurement: "Body weight"
- Value: "greater than 33.4 kg"
- Measurement: "body mass index"
- Measurement: "BMI"
- Value: "5th-85th percentile"